Combined P-glycoprotein and strong cytochrome P450 (CYP) 3A4 inhibitor

The above is a clinical trial exclusion criterion. Annotated with entity spans:
Combined [Drug: P-glycoprotein] and [Qualifier: strong] [Drug: cytochrome P450] (CYP) 3A4 inhibitor